Clinical trial exclusion criterion:
more than tree fingers involvement

Entity relations:
- Has_multiplier("fingers involvement", "more than tree")